Current infectious disease needs antibiotics therapy

The above is a clinical trial exclusion criterion. Annotated with entity spans:
Current [Condition: infectious disease] needs [Drug: antibiotics] therapy